Paciente de 65 años que presenta disnea progresiva de 5 días de evolución hasta hacerse de reposo, ortopnea de tres almohadas y episodios de disnea paroxística nocturna. A la auscultación destaca crepitantes bilaterales, soplo holosistólico irradiado a axila y ritmo de galope por tercer y cuarto ruido. Señale la afirmación INCORRECTA:
1. El tercer ruido coincide con la fase de llenado rápido de la diástole ventricular del ciclo cardiaco.
2. El diagnóstico más probable es el de insuficiencia cardiaca.
3. El soplo holosistólico puede corresponder a una insuficiencia mitral.
4. El cuarto ruido suele aparecer cuando existe un cierto grado de estenosis valvular.

Respuesta correcta: 4. El cuarto ruido suele aparecer cuando existe un cierto grado de estenosis valvular.